Score greater than "0" on the Ocular Pain Assessment in the study eye at Screening

The above is a clinical trial exclusion criterion. Annotated with entity spans:
Score [Value: greater than "0"] on the [Measurement: Ocular Pain Assessment] in the study eye [Temporal: at Screening]